下列何者最常棲居（colonize）於人類之前鼻咽部（anterior nasopharynx）？
A. 破傷風桿菌（Clostridium tetani）
B. 鬆脆類桿菌（Bacteroides fragilis）
C. 金黃色葡萄球菌（Staphylococcus aureus）
D. 幽門螺旋桿菌（Helicobacter pylori）

正確答案：C. 金黃色葡萄球菌（Staphylococcus aureus）